一名26歲男性，已經長達一	以上變得社交退縮，足不出戶。近六個月以來常	有人跟蹤他，要陷害他，有時自言自語好像在和別人對話，若該病人確診為思覺失調症（schizophrenia），下	敘述何者最正確？
A. 心	治	的第一選擇是精神分析
B. 藥物治	第一選擇是多巴胺再回收抑制劑（dopamine reuptake inhibitors）
C. 合併尼古丁（nicotine）濫用時，病人血中的抗精神病藥藥物濃度會增加
D. 神經科學文獻報告，思覺失調症（schizophrenia）患者腦部會有神經元樹突或軸突減少的情形

正確答案：D. 神經科學文獻報告，思覺失調症（schizophrenia）患者腦部會有神經元樹突或軸突減少的情形